Abnormal coagulation profile

The above is a clinical trial exclusion criterion. Annotated with entity spans:
[Condition: Abnormal coagulation profile]